周邊傷害刺激主要是經由 A 與 C 神經纖維傳入脊髓何區？
A. 脊板（lamina）I/II
B. 脊板 III/IV
C. 脊板 VI
D. 脊板 IX/X

正確答案：A. 脊板（lamina）I/II